Clinical trial exclusion criterion:
Vein diameter < 3mm

Annotated entities:
- Measurement: "Vein diameter"
- Value: "< 3mm"